Clinical trial inclusion criterion:
Between the age of 25 to 65 at baseline

Entity relations:
- Has_temporal("age", "at baseline")
- Has_value("age", "Between 25 to 65")